Clinical trial inclusion criterion:
No evidence of recent new inflammatory disease activity (inactive by the Lublin criteria16) with no new relapse for at least five years and no new MRI lesion for at least three years

Entity relations:
- Has_value("Lublin criteria", "inactive")
- AND("inflammatory disease", "Lublin criteria")
- Has_qualifier("inflammatory disease", "new")
- Has_negation("inflammatory disease", "No")
- Has_qualifier("relapse", "new")
- Has_negation("relapse", "no")
- Has_temporal("lesion", "for at least three years")
- AND("MRI", "lesion")
- Has_temporal("relapse", "for at least five years")
- Has_qualifier("lesion", "new")
- Has_negation("lesion", "no")